List polyubiquitin binding proteins involved in NF-kappaB signaling.

NEMO
A20
ABIN-1
ABIN-2
optineurin
p62